Clinical trial exclusion criterion:
Documented restrictions on military duties

Annotated entities:
- Observation: "restrictions on military duties"